El hidruro de aluminio y litio es un nucléofilo suficientemente fuerte para adicionarse al grupo carbonilo de los iones carboxilato. Este proceso permite la obtención de:
1. Alcoholes primarios.
2. Alcoholes secundarios.
3. Alcoholes terciarios.
4. Cetonas.
5. Éteres.

Respuesta correcta: 1. Alcoholes primarios.